El tratamiento para las adicciones que busca el cambio terapéutico manipulando las contingencias naturales que pueden estar influyendo en el mantenimiento de la adicción, utilizando reforzadores para facilitar el proceso, se denomina:
1. Entrenamiento en autocontrol.
2. Programa de prevención de recaídas.
3. Entrenamiento en habilidades sociales.
4. Programa de reforzamiento comunitario.

Respuesta correcta: 4. Programa de reforzamiento comunitario.